In which fields of DNA sequencing are Bloom filters applied?

Further, we note that Bloom filters would be suitable to implicitly store spaced seeds and be tolerant to sequencing errors.  It uses a pair of cache oblivious Bloom filters, one holding a uniform sample of [Formula: see text]-spaced sequenced [Formula: see text]-mers and the other holding [Formula: see text]-mers classified as likely correct, using a simple statistical test.